Clinical trial exclusion criterion:
Platelet count < 75 at the time of enrollment

Entity relations:
- Has_value("Platelet count", "< 75")